What is  the clinical value of naltrexone in Parkinson's disease patients?

Naltrexone does not improve clinical features, including motor function, in Parkinson's disease patients. Naltrexone was shown to be effective for treatment of pathological gambling in Parkinson's disease patients.